闌尾（appendix）手術之切口，何者較容易造成腹直肌（rectus abdominis）的血液供應和支配神經受損？
A. 正中切口（median or midline incision）
B. 旁正中切口（paramedian incision）
C. 麥白爾尼切口（McBurney incision）
D. 旁腹直肌鞘切口（pararectus incision (along the lateral border of rectus sheath)）

正確答案：D. 旁腹直肌鞘切口（pararectus incision (along the lateral border of rectus sheath)）